Severe liver disease (including ALT or AST=2.5-fold the normal upper limit), biliary obstruction;

The above is a clinical trial exclusion criterion. Annotated with entity spans:
[Qualifier: Severe] [Condition: liver disease] (including [Measurement: ALT] or [Measurement: AST][Value: =2.5-fold the normal upper limit]), [Condition: biliary obstruction];